一位 85 歲王先生，患有高血壓、糖尿病多年。5 年前曾中風，可行走但步履不穩。自己並不清楚目前服用的藥物，常因感冒、頭暈等不舒服症狀至診所就診，會自行停用原本服用之慢性病治療藥物。 某天半夜起床小解，因跌倒造成右股骨骨折住院，下列敘述何者正確？
A. 此個案年紀大於 80 歲，是無法改變的跌倒危險因子
B. 此個案跌倒單純為步履不穩造成
C. 此個案多重用藥不會增加跌倒危險性
D. 此個案不需考慮其他醫源性問題

正確答案：A. 此個案年紀大於 80 歲，是無法改變的跌倒危險因子